Clinical trial exclusion criterion:
Renal dysfunction, including endogenous creatinine clearance male<120ml/min, female<105ml/min, serum creatinine=2mg/dl (186umol/L), Renal function progressive decline, GFR<30ml•min-1•1.73m-2;

Annotated entities:
- Condition: "Renal dysfunction"
- Measurement: "endogenous creatinine clearance"
- Person: "male"
- Person: "female"
- Value: "<105ml/min"
- Value: "<120ml/min"
- Measurement: "serum creatinine"
- Value: "=2mg/dl"
- Value: "186umol/L"
- Measurement: "Renal function"
- Value: "progressive decline"
- Measurement: "GFR"
- Value: "<30ml•min-1•1.73m-2"